Clinical trial exclusion criterion:
BMI>=35kg/m2

Annotated entities:
- Measurement: "BMI"
- Value: ">=35kg/m2"